Clinical trial exclusion criterion:
Patients who have active infections requiring therapy.

Annotated entities:
- Condition: "infections"
- Procedure: "therapy"
- Qualifier: "requiring therapy"